Clinical trial exclusion criterion:
Life expectancy <12 months based on investigator's judgement

Annotated entities:
- Measurement: "Life expectancy"
- Value: "<12 months"
- Non-representable: "based on investigator's judgement"